Clinical trial inclusion criterion:
BMI 18-35

Entity relations:
- Has_value("BMI", "18-35")